成年婦女之 body mass index（BMI）的理想值是：
A. 2
B. 5
C. 12
D. 22

正確答案：D. 22